Clinical trial exclusion criterion:
Limited English proficiency (LEP)

Entity relations:
- Subsumes("Limited English proficiency", "LEP")